Clinical trial exclusion criterion:
Serum total bilirubin > 3 times the upper limit of normal at screening.

Entity relations:
- Has_value("Serum total bilirubin", "> 3 times the upper limit of normal")
- Has_temporal("Serum total bilirubin", "at screening")